Clinical trial inclusion criterion:
CPPE along with evidence of septated pleural effusion on pleural ultrasonography and/or chest CT scan

Annotated entities:
- Condition: "septated pleural effusion"
- Procedure: "pleural ultrasonography"
- Procedure: "chest CT scan"
- Condition: "CPPE"
- Mood: "evidence of"